小玉每年在晚秋時常發作氣喘，醫師建議進行抽血來檢測過敏原，主要是檢查血清中對過敏原具特異性之何種抗體？
A. IgM
B. IgG
C. IgE
D. IgA

正確答案：C. IgE